Clinical trial inclusion criterion:
Serum glutamic oxaloacetic transaminase (SGOT) and serum glutamate pyruvate transaminase (SGPT) < 2.5 x upper limit of normal for patients without liver metastases OR SGOT and SGPT < 5 x upper limit of normal for patients with liver metastases

Entity relations:
- Subsumes("Serum glutamic oxaloacetic transaminase", "SGOT")
- Subsumes("serum glutamate pyruvate transaminase", "SGPT")
- Has_value("Serum glutamic oxaloacetic transaminase", "< 2.5 x upper limit of normal")
- Has_negation("liver metastases", "without")
- AND("liver metastases", "Serum glutamic oxaloacetic transaminase")
- Has_value("SGOT", "< 5 x upper limit of normal")
- AND("liver metastases", "SGOT")
- Has_value("serum glutamate pyruvate transaminase", "< 2.5 x upper limit of normal")
- AND("liver metastases", "serum glutamate pyruvate transaminase")
- Has_value("SGPT", "< 5 x upper limit of normal")
- AND("liver metastases", "SGPT")